Clinical trial exclusion criterion:
insulin-dependent DM (diabetes mellitus), poorly controlled type II DM

Annotated entities:
- Condition: "insulin-dependent DM"
- Condition: "diabetes mellitus"
- Qualifier: "poorly controlled"
- Condition: "type II DM"